為確診骨盆腔積血，通常經由下列何處施行陷凹穿刺抽液術（culdocentesis）？
A. 陰道後穹隆（posterior fornix of vagina）
B. 陰道前穹隆（anterior fornix of vagina）
C. 膀胱後壁（posterior wall of urinary bladder）
D. 直腸前壁（anterior wall of rectum）

正確答案：A. 陰道後穹隆（posterior fornix of vagina）